Clinical trial exclusion criterion:
The score of HAMD =21

Entity relations:
- Has_value("score of HAMD", "=21")